Clinical trial inclusion criterion:
Sedentary lifestyle, defined as <150 min/wk of moderate physical activity as assessed by CHAMPS questionnaire

Annotated entities:
- Condition: "Sedentary lifestyle"
- Value: "<150 min/wk"
- Measurement: "moderate physical activity"
- Procedure: "CHAMPS questionnaire"